¿Cómo se denomina el hecho de que una neurona emita varios colaterales axónicos que establecen sinapsis con varias neuronas diferentes?:
1. Divergencia.
2. Sinapsis seriadas.
3. Sinapsis en paralelo.
4. Convergencia.

Respuesta correcta: 1. Divergencia.